1. low serum levels of HDL cholesterol (<40 mg⁄dL for men or < 50 mg ⁄dL for women);

The above is a clinical trial inclusion criterion. Annotated with entity spans:
1. [Value: low] [Measurement: serum levels of HDL cholesterol] ([Value: <40 mg⁄dL] for [Person: men] or [Value: < 50 mg ⁄dL] for [Person: women]);